Clinical trial exclusion criteria:
need for major amputation known before intervention
allergy to Paclitaxel
contraindication for combined antiplatelet treatment
life expectancy <1 year
hypersensitivity or contraindication to one of the study drugs
lack of consent

Annotated entities:
- Condition: "major amputation"
- Non-representable: "known before intervention"
- Drug: "Paclitaxel"
- Condition: "allergy"
- Condition: "contraindication"
- Procedure: "combined antiplatelet treatment"
- Observation: "life expectancy"
- Value: "<1 year"
- Condition: "hypersensitivity"
- Condition: "contraindication"
- Multiplier: "one of"
- Drug: "study drugs"
- Informed_consent: "lack of consent"